Clinical trial exclusion criterion:
Peptic ulcer or reflux esophagitis

Annotated entities:
- Condition: "reflux esophagitis"
- Condition: "Peptic ulcer"